Women pregnant or lactating.

The above is a clinical trial exclusion criterion. Annotated with entity spans:
[Person: Women] [Condition: pregnant] or [Condition: lactating].